¿Qué tipo de anomalías son la Micropsia y autometamorfopsia?
1. Anomalías en la percepción de la cualidad.
2. Anomalías en la percepción del tamaño/forma.
3. Anomalías en la percepción de la intensidad.
4. Engaños perceptivos.
5. La misma distorsión perceptiva.

Respuesta correcta: 2. Anomalías en la percepción del tamaño/forma.